Clinical trial exclusion criterion:
Subjects who refuse to subscribe written informed consents or can't cooperate with the trial well.

Entity relations:
- OR("refuse to subscribe written informed consents", "can't cooperate with the trial")